Clinical trial inclusion criterion:
Patients with Ph (BCR/ABL) positive de novo < 55 years old (it is advisable to include patients over 55 years LAL07OPH protocol).

Annotated entities:
- Measurement: "Ph (BCR/ABL)"
- Value: "positive"
- Qualifier: "de novo"
- Value: "< 55 years"
- Person: "old"
- Non-representable: "(it is advisable to include patients over 55 years LAL07OPH protocol)"